previous operation of tongue

The above is a clinical trial exclusion criterion. Annotated with entity spans:
[Temporal: previous] [Procedure: operation of tongue]